Active pathological bleeding

The above is a clinical trial exclusion criterion. Annotated with entity spans:
[Temporal: Active] [Condition: pathological bleeding]